對於嚴重之第四型狼瘡性腎炎，目前最被推薦之二種細胞毒害藥物（cytotoxic drugs）為何？
A. cyclophosphamide 或 mycophenolate mofetil
B. cyclosporine 或 cyclophosphamide
C. azathioprine 或 methotrexate
D. azathioprine 或 cyclophosphamide

正確答案：A. cyclophosphamide 或 mycophenolate mofetil